Clinical trial inclusion criterion:
Admitted for labor management & develops a fever of 100.4 F or greater

Entity relations:
- Has_mood("labor management", "Admitted for")
- Has_value("fever", "100.4 F or greater")